下列何種心臟病於身體診察時，比較不會有下肢脈搏微弱的現象？
A. 主動脈弓窄縮（coarctation）
B. 主動脈弓中斷（interrupted aortic arch）
C. 主動脈與肺動脈窗（aorticopulmonary window defect）
D. 左心發育不全症（hypoplastic left heart syndrome）

正確答案：C. 主動脈與肺動脈窗（aorticopulmonary window defect）